Clinical trial inclusion criterion:
Undergoing right upper extremity surgery with supraclavicular block as the primary anesthetic

Entity relations:
- Has_qualifier("supraclavicular block", "primary anesthetic")
- AND("right upper extremity surgery", "supraclavicular block")
- Has_temporal("right upper extremity surgery", "Undergoing")